Clinical trial exclusion criterion:
Use of anti-coagulant treatment such as heparin, warfarin, platelet inhibitors, thrombin and factor X inhibitors.

Entity relations:
- Subsumes("anti-coagulant treatment", "heparin")
- OR("heparin", "thrombin", "platelet inhibitors", "warfarin", "factor X inhibitors")